Clinical trial inclusion criterion:
Undergoing mid-urethral sling surgery

Annotated entities:
- Procedure: "mid-urethral sling surgery"